Clinical trial exclusion criterion:
Subject has any medical condition that would make it unsafe for them to participate, per Investigator's descretion

Annotated entities:
- Non-representable: "Subject has any medical condition that would make it unsafe for them to participate, per Investigator's descretion"